small bowel obstruction

The above is a clinical trial exclusion criterion. Annotated with entity spans:
[Condition: small bowel obstruction]